Clinical trial inclusion criterion:
Age between 18 and 70 years

Annotated entities:
- Person: "Age"
- Value: "between 18 and 70 years"